Clinical trial exclusion criterion:
Cardiac surgery already scheduled in the next three months

Annotated entities:
- Procedure: "Cardiac surgery"
- Mood: "scheduled"
- Temporal: "in the next three months"
- Reference_point: "three months"